Clinical trial inclusion criterion:
Subjects must have normal or clinically acceptable physical exam

Entity relations:
- Has_value("physical exam", "normal")
- OR("normal", "clinically acceptable")